Entre las técnicas psicológicas que se aplican en las guías y protocolos de deshabituación tabáquica NO se encuentra:
1. La técnica del entrenamiento en solución de problemas de Shiffman.
2. El contrato de contingencias.
3. La monitorización de parámetros biológicos.
4. El registro del consumo de cigarrillos.

Respuesta correcta: 3. La monitorización de parámetros biológicos.